下列何種抗癌藥物最不會造成白血球減少（neutropenia）？
A. sunitinib
B. paclitaxel
C. gefitinib
D. gemcitabine

正確答案：C. gefitinib